An active or any history of neurological disorder, including but not limited to seizure disorder, epilepsy, stroke, neurological disease, cognitive impairment, head trauma with prolonged loss of consciousness (>10 minutes), or migraine headaches;

The above is a clinical trial exclusion criterion. Annotated with entity spans:
An [Qualifier: active] or any [Temporal: history] of [Condition: neurological disorder], including but not limited to [Condition: seizure disorder], [Condition: epilepsy], [Condition: stroke], [Condition: neurological disease], [Condition: cognitive impairment], [Condition: head trauma] with [Condition: prolonged loss of consciousness] ([Qualifier: >10 minutes]), or [Condition: migraine headaches];